History of seizure disorder or at increased risk for development of a seizure disorder including, but not limited to, complicated febrile seizure and history of significant head injury.

The above is a clinical trial exclusion criterion. Annotated with entity spans:
History of [Condition: seizure disorder] or at increased risk for development of a seizure disorder including, but not limited to, [Condition: complicated febrile seizure] and history of significant [Condition: head injury].